Patient declined informed consent

The above is a clinical trial exclusion criterion. Annotated with entity spans:
Patient [Negation: declined] [Competing_trial: informed consent]